失智症（dementia）最常見之病因是：
A. 多發性腦梗塞失智症（multi-infarct dementia）
B. 酒精性失智症（alcoholic dementia）
C. 阿茲海默症（Alzheimer's disease）
D. 腦外傷（cerebral trauma）

正確答案：C. 阿茲海默症（Alzheimer's disease）